Clinical trial inclusion criterion:
The patient has no major impairment of renal or hepatic function, as defined by the following laboratory parameters: total bilirubin <1.5 X ULN; AST, ALT<2.5X ULN (<5 X ULN if liver metastases are present)

Entity relations:
- Has_negation("major impairment of hepatic function", "no")
- AND("<5 X ULN", "liver metastases")
- Has_value("ALT", "<2.5X ULN")
- Has_value("AST", "<2.5X ULN")
- Has_value("total bilirubin", "<1.5 X ULN")
- Subsumes("major impairment of hepatic function", "total bilirubin")
- OR("<2.5X ULN", "<5 X ULN")
- OR("total bilirubin", "AST")
- OR("major impairment of hepatic function", "major impairment of renal function")